70 歲的王老太太最近 3 年常腳痠，好像螞蟻在鑽，夜裡睡不著覺，只好起來走一走較舒服，因為這樣的困擾半夜來急診，急診醫師因為王老太太急躁不安，所以除了給予口服抗焦慮藥物外，並加打一支 haloperidol，但病人的痠痛沒有顯著改善，反而更加坐立不安。王老太太最可能的臨床診斷是什麼？
A. 夢遊症（sleepwalking disorder）
B. 入眠期幻覺症（hypnagogic hallucination）
C. 不寧腿症候群（restless legs syndrome）
D. 週期性肢動症（periodic limb movement syndrome）

正確答案：C. 不寧腿症候群（restless legs syndrome）